¿Cuál de los siguientes cuadros clínicos es compatible con el diagnóstico de tiroiditis subaguda?
1. Mujer de 38 años con antecedentes de 2 semanas de dolor en tiroides, elevación de la T4 y de la T3, TSH baja y aumento de la captación de tecnecio en la gammagrafía.
2. Hombre de 42 años de edad con antecedentes de dolor en glándula tiroidea hace 4 meses, fatiga, malestar general, concentraciones bajas de T4 libre y elevadas de TSH.
3. Mujer de 31 años de edad con glándula tiroidea aumentada de tamaño, indolora a la palpación, TSH baja, T4 y T3 libres elevadas y aumento de la captación de tecnecio en la gammagrafía.
4. Mujer de 30 años de edad en tratamiento con anticonceptivos orales, con molestias en el cuello y nódulo tiroideo palpable que en la ecografía se comporta como sólido. Aumento de la T4 total con TSH normal.
5. Hombre de 46 años de edad que consulta por fatiga durante los últimos 3 meses. En la analítica se objetivan concentraciones bajas de T4 y T3 libres y de TSH.

Respuesta correcta: 2. Hombre de 42 años de edad con antecedentes de dolor en glándula tiroidea hace 4 meses, fatiga, malestar general, concentraciones bajas de T4 libre y elevadas de TSH.